Donation of blood or blood products within 8 weeks prior to vaccination or during the three week study period following

The above is a clinical trial exclusion criterion. Annotated with entity spans:
[Procedure: Donation of blood] or blood products [Temporal: within 8 weeks prior to vaccination] or [Temporal: during the three week study period] following